La función fundamental de los ganglios basales es:
1. Controlar el movimiento.
2. Aumentar la audición.
3. Mejorar la capacidad del gusto.
4. Aumentar el apetito.
5. Incrementar la micción.

Respuesta correcta: 1. Controlar el movimiento.